Clinical trial inclusion criteria:
1. Must have given written informed consent (signed and dated) and any authorizations required by local law
2. 18 to 75 years old (inclusive)
3. Male or female with a diagnosis of PBC, by at least two of the following criteria:
History of AP above ULN for at least six months
Positive Anti-Mitochondrial Antibodies (AMA) titers (>1/40 on immunofluorescence or M2 positive by enzyme linked immunosorbent assay (ELISA) or positive PBC-specific antinuclear antibodies
Documented liver biopsy result consistent with PBC
4. On a stable and recommended dose of UDCA for the past twelve months
5. AP ≥ 1.67 × ULN
6. For females of reproductive potential, use of at least one barrier contraceptive and a second effective birth control method during the study and for at least two weeks after the last dose. For male subjects, use of appropriate contraception (e.g., condoms), so their female partners of reproductive potential do not become pregnant during the study and for at least two weeks after the last dose

Annotated entities:
- Parsing_Error: "1."
- Post-eligibility: "Must have given written informed consent (signed and dated) and any authorizations required by local law"
- Parsing_Error: "2."
- Value: "18 to 75 years old (inclusive)"
- Person: "years old"
- Parsing_Error: "3."
- Person: "Male"
- Person: "female"
- Condition: "PBC"
- Multiplier: "at least two"
- Parsing_Error: "following criteria"
- Measurement: "following criteria"
- Measurement: "AP"
- Value: "above ULN"
- Temporal: "for at least six months"
- Measurement: "Positive Anti-Mitochondrial Antibodies (AMA) titers"
- Value: ">1/40"
- Measurement: "immunofluorescence"
- Value: "M2 positive"
- Measurement: "enzyme linked immunosorbent assay (ELISA)"
- Measurement: "PBC-specific antinuclear antibodies"
- Value: "positive"
- Procedure: "liver biopsy"
- Condition: "PBC"
- Parsing_Error: "4."
- Qualifier: "stable dose"
- Qualifier: "recommended dose"
- Drug: "UDCA"
- Temporal: "for the past twelve months"
- Parsing_Error: "5."
- Measurement: "AP"
- Value: "≥ 1.67 × ULN"
- Parsing_Error: "6."
- Condition: "reproductive potential"
- Person: "females"
- Multiplier: "at least one"
- Device: "barrier contraceptive"
- Qualifier: "second"
- Device: "birth control method"
- Qualifier: "effective"
- Subjective_judgement: "effective"
- Temporal: "during the study"
- Temporal: "for at least two weeks after the last dose"
- Reference_point: "the last dose"
- Person: "male"
- Device: "contraception"
- Device: "condoms"
- Qualifier: "appropriate"
- Subjective_judgement: "appropriate"
- Person: "female"
- Condition: "reproductive potential"
- Condition: "pregnant"
- Negation: "not become"
- Temporal: "during the study"
- Temporal: "for at least two weeks after the last dose"
- Reference_point: "the last dose"
- Post-eligibility: "For male subjects, use of appropriate contraception (e.g., condoms), so their female partners of reproductive potential do not become pregnant during the study and for at least two weeks after the last dose"
- Non-query-able: "For male subjects, use of appropriate contraception (e.g., condoms), so their female partners of reproductive potential do not become pregnant during the study and for at least two weeks after the last dose"